Clinical trial exclusion criterion:
Had a history of, or ongoing, chronic or recurrent infectious disease

Entity relations:
- Has_qualifier("infectious disease", "chronic")
- Has_temporal("infectious disease", "history")
- OR("chronic", "recurrent")
- OR("history", "ongoing")